mRS=2;

The above is a clinical trial exclusion criterion. Annotated with entity spans:
[Measurement: mRS][Value: =2];